Clinical trial inclusion criterion:
Willing and able to participate after the study has been explained

Annotated entities:
- Non-query-able: "Willing and able to participate after the study has been explained"